Clinical trial exclusion criterion:
Blood group(ABO)-incompatible transplants.

Entity relations:
- Has_qualifier("transplants", "Blood group(ABO)-incompatible")